通常女性陰毛的發育延伸至大腿，係指唐納分期（Tanner stage）的第幾期？
A. 第二期
B. 第三期
C. 第四期
D. 第五期

正確答案：D. 第五期